Clinical trial exclusion criterion:
Congenital anomalies

Annotated entities:
- Condition: "Congenital anomalies"